Clinical trial inclusion criterion:
A medication for apathy is appropriate, in the opinion of the study physician

Entity relations:
- AND("medication for apathy", "apathy")